Clinical trial exclusion criterion:
4. Active brain metastases. Patients with treated brain metastases are eligible, if (1) radiation therapy was completed at least 2 weeks prior to study entry; (2) follow-up scan shows no disease progression; and (3) patient does not require steroids.

Entity relations:
- Has_temporal("brain metastases", "Active")
- multi("treated", "treated")
- Has_qualifier("brain metastases", "treated")
- Has_index("at least 2 weeks prior to study entry", "study entry")
- Has_negation("disease progression", "no")
- AND("follow-up scan", "disease progression")
- Has_mood("steroids", "require")
- Has_negation("steroids", "not")
- Has_temporal("radiation therapy", "at least 2 weeks prior to study entry")
- AND("brain metastases", "radiation therapy")
- Has_negation("are eligible", "are eligible")